下列何者為從站立、到走路、再到快跑的過程中，肌纖維參與的順序？
A. fast-oxidative-glycolytic fibers → fast-glycolytic fibers → slow-oxidative fibers
B. slow-oxidative fibers → fast-oxidative-glycolytic fibers → fast-glycolytic fibers
C. slow-oxidative fibers → fast-glycolytic fibers → fast-oxidative-glycolytic fibers
D. fast-oxidative-glycolytic fibers → slow-oxidative fibers → fast-glycolytic fibers

正確答案：B. slow-oxidative fibers → fast-oxidative-glycolytic fibers → fast-glycolytic fibers